¿Cómo se evalúa la ruta ortográfica o directa en los trastornos de escritura?:
1. Repetición de palabras.
2. Dictado de pseudopalabras.
3. Dictado de palabras homófonas (p. ej., vaca/baca).
4. Deletreo de una palabra.

Respuesta correcta: 3. Dictado de palabras homófonas (p. ej., vaca/baca).